Participation in any other therapeutic drug study within 60 days preceding inclusion.

The above is a clinical trial exclusion criterion. Annotated with entity spans:
[Competing_trial: Participation in any other therapeutic drug study within 60 days preceding inclusion.]